Clinical trial exclusion criterion:
Previous myocardial infarction, coronary artery intervention, coronary artery bypass surgery, or other cardiac surgery

Annotated entities:
- Condition: "myocardial infarction"
- Temporal: "Previous"
- Procedure: "coronary artery intervention"
- Procedure: "coronary artery bypass surgery"
- Procedure: "other cardiac surgery"